Clinical trial inclusion criterion:
History of coronary revascularization, i.e., percutaneous coronary intervention (PCI) or coronary artery bypass graft (CABG), not including the elective PCI during the index hospitalization

Annotated entities:
- Procedure: "coronary revascularization"
- Procedure: "percutaneous coronary intervention"
- Procedure: "PCI"
- Procedure: "coronary artery bypass graft"
- Procedure: "CABG"
- Negation: "not"
- Procedure: "PCI"
- Qualifier: "elective"
- Temporal: "during the index hospitalization"
- Reference_point: "index hospitalization"